Presence of at least 2 cryopreserved good quality cleavage-stage embryo (good quality cleavage-stage embryos display stage-specific cell division, have blastomeres of fairly equal size with few to no cytoplasmic fragments).

The above is a clinical trial inclusion criterion. Annotated with entity spans:
Presence of [Multiplier: at least 2] [Qualifier: cryopreserved] [Qualifier: good quality] [Observation: cleavage-stage embryo] ([Qualifier: good quality] [Observation: cleavage-stage embryos] display [Qualifier: stage-specific cell division], [Qualifier: have blastomeres of fairly equal size] with [Qualifier: few to no cytoplasmic fragments]).